Clinical trial exclusion criterion:
DKA(Diabetic Ketoacidosis) or HHS(Hyperosmoloar Hyperglycaemic Syndrome) within the last 6 months

Entity relations:
- Subsumes("DKA", "Diabetic Ketoacidosis")
- Subsumes("HHS", "Hyperosmoloar Hyperglycaemic Syndrome")
- Has_temporal("DKA", "within the last 6 months")
- OR("DKA", "HHS")